What is the role of Gata3 in Th2 cells?

RHS6 coordinately regulates the Th2 cytokine genes by recruiting GATA3, SATB1, and IRF4. RHS6 recruited transcription factors GATA3, SATB1, and IRF4, which play important roles in expression of all three Th2 cytokine genes. posttranslational modifications of Gata3 that control the regulation of IFNg expression in memory Th2 cells.